Clinical trial inclusion criterion:
Smoked at least 100 cigarettes in lifetime

Entity relations:
- Has_multiplier("Smoked", "at least 100 cigarettes")